Received radiation to more than 10% of bone.

The above is a clinical trial exclusion criterion. Annotated with entity spans:
Received [Procedure: radiation] to [Value: more than 10%] of [Qualifier: bone].